Unwillingness or inability to comply with protocol procedures and assessments

The above is a clinical trial exclusion criterion. Annotated with entity spans:
[Informed_consent: Unwillingness or inability to comply with protocol procedures and assessments]